下列何種藥物不具有改善骨質疏鬆的效果？
A. vitamin D
B. alendronate
C. raloxifene
D. danazol

正確答案：D. danazol